Clinical trial exclusion criterion:
Any systemic infection during the study.

Entity relations:
- Has_temporal("infection", "during the study")
- Has_index("during the study", "the study")
- Has_qualifier("infection", "systemic")